一位40歲女性病人由大腸鏡發現在升結腸有一腫瘤，而沒有其他息肉或發炎性大腸病變。病理切片發現是腺癌，分化不好 （poorly differentiated adenocarcinoma），她媽媽於48歲死於子宮內膜癌，她爸爸目前健康良好，她43歲的姊姊在2年前診斷為早期結腸癌，追蹤至今無復發。此外，病人無其他兄弟姊妹，經過右半結腸切除，證實是T3 N1 M0腺癌，她擔心2個小孩有結腸癌的風險，想做基因檢測，此病人最有可能是那一種家族性的癌症症候群？
A. BRCA2突變
B. 遺傳性非息肉性大腸直腸癌（hereditary nonpolyposis colorectal cancer（HNPCC））
C. 家族性腺瘤性多發性息肉症候群（familial adenomatous polyposis（FAP））
D. Li-Fraumeni症候群（Li-Fraumeni syndrome）

正確答案：B. 遺傳性非息肉性大腸直腸癌（hereditary nonpolyposis colorectal cancer（HNPCC））